History of scleroderma

The above is a clinical trial inclusion criterion. Annotated with entity spans:
[Temporal: History] of [Condition: scleroderma]